下列有關構成表皮（epidermis）的細胞敘述，何者錯誤？
A. 角質細胞（keratinocyte）是表皮中含量最多的細胞
B. 黑色素細胞（melanocyte）的細胞體主要分布在表皮的基底層（stratum basale）
C. 默克耳氏細胞（Merkel's cell）主要分布在表皮的棘狀層（stratum spinosum）
D. 蘭格罕氏細胞（Langerhans' cell）具有樹突狀突起（dendritic process），是一種抗原呈現細胞（antigenpresenting cell）

正確答案：C. 默克耳氏細胞（Merkel's cell）主要分布在表皮的棘狀層（stratum spinosum）